Clinical trial exclusion criterion:
receiving bismuth salts, PPIs, or antibiotics in the previous month.

Annotated entities:
- Drug: "bismuth salts"
- Drug: "PPIs"
- Drug: "antibiotics"
- Temporal: "in the previous month"